若病人沒有接受手術。數年之後，病人呈發紺現象，經超音波檢查發現有右至左的分流現象，會造成此現象主要的原因為何？
A. 肺動脈血管壁硬化，使肺動脈血管阻力增加
B. 心室中隔缺損變小，肺動脈血流減少
C. 肺靜脈血管開口變狹窄，使肺動脈血管阻力增加
D. 三尖瓣逆流，使肺動脈血流減少

正確答案：A. 肺動脈血管壁硬化，使肺動脈血管阻力增加